Which is the genetic cause for the development of Fanconi anemia complementation group D1?

Fanconi anemia complementation group D1 (FANCD1) was shown to be induced by biallelic mutations in the BRCA2 breast-cancer-susceptibility gene.